有關misoprostol之敘述，下列何者正確？
A. Misoprostol為E2前列腺素（prostaglandin）
B. Misoprostol比催產素（oxytocin）更能有效預防產後大出血
C. 用於預防產後大出血的劑量為單次口服600 µg
D. 最有效之給予方式為肌肉注射

正確答案：C. 用於預防產後大出血的劑量為單次口服600 µg